Clinical trial exclusion criterion:
Any patient with esophageal cancer who is not deemed a surgical candidate or who is not deemed a candidate for the Ivor Lewis technique of esophagectomy (with intrathoracic anastomosis).

Annotated entities:
- Condition: "esophageal cancer"
- Negation: "not"
- Observation: "candidate"
- Negation: "not"
- Observation: "candidate"
- Procedure: "surgical"
- Qualifier: "Ivor Lewis technique"
- Procedure: "esophagectomy"
- Condition: "intrathoracic anastomosis"
- Qualifier: "with intrathoracic anastomosis"